Clinical trial inclusion criterion:
successful angioplasty (residual stenosis < 30%) on a significant stenosis (maximal systolic speed 3 times > from basal maximal systolic speed, stenosis > 70% on angiography) on the venous-prosthesis anastomosis or on the venous segment 5 cm after the anastomosis of a prosthetic haemodialysis vascular access (at least 1 month old)

Entity relations:
- Has_qualifier("on the venous-prosthesis anastomosis angioplasty", "successful")
- Has_value("residual stenosis", "< 30%")
- Subsumes("successful", "residual stenosis")
- Has_qualifier("stenosis", "significant")
- AND("on the venous-prosthesis anastomosis angioplasty", "stenosis")
- Has_value("maximal systolic speed", "3 times > from basal")
- Has_value("stenosis", "> 70%")
- AND("angiography", "stenosis")
- AND("angiography", "maximal systolic speed")
- Subsumes("successful", "angiography")